Clinical trial inclusion criteria:
19 years old and above.
Patients who previously have received a liver transplant over the last six months and within last three years.
Patients who are on Tacrolimus immunosuppressive therapy twice a day for at least two weeks.
Patients who have normal liver function and renal function.
Patients who have been monitored without complication such as acute rejection.
Patients willing to sign his/her consent.

Annotated entities:
- Person: "old"
- Value: "19 years and above"
- Procedure: "liver transplant"
- Temporal: "last six months and within last three years"
- Drug: "Tacrolimus"
- Multiplier: "twice a day"
- Temporal: "at least two weeks"
- Qualifier: "normal"
- Condition: "liver function"
- Condition: "renal function"
- Negation: "without"
- Condition: "complication"
- Condition: "acute rejection"
- Informed_consent: "Patients willing to sign his/her consent"